Clinical trial exclusion criterion:
Antepartum haemorrhage

Annotated entities:
- Condition: "Antepartum haemorrhage"